氯化鈣（CaCl2）靜脈注射，不適合用於下列何種病況的治療？
A. 高血鉀（hyperkalemia）
B. 高血鎂（hypermagnesemia）
C. 氫氟酸（HF, hydrofluoric acid）中毒
D. 毛地黃（digoxin）中毒

正確答案：D. 毛地黃（digoxin）中毒